Non-obese: defined as BMI less than 28 kg/m2

The above is a clinical trial inclusion criterion. Annotated with entity spans:
[Negation: Non]-[Condition: obese]: defined as [Measurement: BMI] [Value: less than 28 kg/m2]